any other factors which would interfere with pain assessment and management

The above is a clinical trial exclusion criterion. Annotated with entity spans:
any [Condition: other factors] which would [Condition: interfere] with [Procedure: pain assessment] and [Procedure: management]